History of hepatic encephalopathy or variceal hemorrhage

The above is a clinical trial exclusion criterion. Annotated with entity spans:
History of [Condition: hepatic encephalopathy] or [Condition: variceal hemorrhage]